下列何者由腦幹（brainstem）背側發出？
A. 動眼神經（oculomotor nerve）
B. 外旋神經（abducens nerve）
C. 滑車神經（trochlear nerve）
D. 副神經（accessory nerve）

正確答案：C. 滑車神經（trochlear nerve）